Clinical trial inclusion criterion:
Radial arterial pulse may be present or absent by palpation.

Entity relations:
- Has_qualifier("pulse", "Radial arterial")
- Has_value("palpation", "present")
- AND("pulse", "palpation")
- OR("present", "absent")